El complejo Mycobacterium tuberculosis incluye el bacilo causante de la tuberculosis humana (Mycobacterium tuberculosis hominis, bacilo de Koch), así como otras micobacterias, entre las que se encuentran las siguientes, excepto una:
1. Mycobacterium bovis.
2. Mycobacterium africanum.
3. Bacilo de Calmette-Guerin (BCG).
4. Mycobacterium microti.
5. Mycobacterium avium-intracellulare.

Respuesta correcta: 5. Mycobacterium avium-intracellulare.